Clinical trial exclusion criterion:
A history of suicidal ideation and behaviour, including self-harm and/or harm to others.

Entity relations:
- OR("suicidal ideation", "self-harm", "harm to others", "suicidal behaviour")